Aged 18 years or older, male or female.

The above is a clinical trial inclusion criterion. Annotated with entity spans:
[Person: Aged] [Value: 18 years or older], [Person: male] or [Person: female].